Clinical trial exclusion criterion:
Night or rotating shift workers

Annotated entities:
- Person: "rotating shift workers"
- Person: "Night shift workers"